En la patología del suelo pélvico ¿cuál es el grado que corresponde a la situación en la que el punto más declive está a la altura del introito?:
1. Grado 1.
2. Grado 2.
3. Grado 3.
4. Grado 4.

Respuesta correcta: 2. Grado 2.